Which conditions are manifested by TRIM8 mutations?

Focal segmental glomerulosclerosis, severe developmental delay, intellectual disability and epilepsy.